Normal hormonal investigation: TSH, PRL, FBS.

The above is a clinical trial inclusion criterion. Annotated with entity spans:
[Value: Normal] [Procedure: hormonal investigation:] [Measurement: TSH], [Measurement: PRL], [Measurement: FBS].